關於子宮壁（uterine wall）的敘述，下列何者正確？
A. 只有子宮內膜（endometrium）會隨月經週期（menstrual cycle）改變
B. 子宮肌層（myometrium）具有二層平滑肌，外層（outer layer）最厚
C. 懷孕時，子宮肌層（myometrium）的平滑肌細胞會肥大（hypertrophy）和增生（hyperplasia）
D. 子宮頸（cervix）平滑肌的含量多於子宮體（uterine body）

正確答案：C. 懷孕時，子宮肌層（myometrium）的平滑肌細胞會肥大（hypertrophy）和增生（hyperplasia）